下列關於第一型人類免疫缺乏病毒（HIV-1）致病機轉之敘述，何者錯誤？
A. 可引起 CD4-T 淋巴細胞的減少
B. 可引起 B 淋巴細胞的減少
C. 可引起體液性及細胞性免疫反應（humoral and cellular immune responses）降低
D. 可引起巨噬細胞（macrophage）功能變差

正確答案：B. 可引起 B 淋巴細胞的減少